Clinical trial inclusion criterion:
Have a planned non-emergent surgical procedure or clinical situation (e.g., intubation) that requires moderate or deep NMB with either rocuronium or vecuronium.

Entity relations:
- Subsumes("clinical situation", "intubation")
- Has_qualifier("surgical procedure", "non-emergent")
- Has_mood("surgical procedure", "planned")
- Has_qualifier("NMB", "moderate")
- AND("NMB", "rocuronium")
- AND("surgical procedure", "NMB")
- OR("surgical procedure", "clinical situation")
- OR("moderate", "deep")
- OR("rocuronium", "vecuronium")